With 3-4 grad Allergy to any drug in the treatment

The above is a clinical trial exclusion criterion. Annotated with entity spans:
With [Qualifier: 3-4 grad] [Condition: Allergy] to [Qualifier: any] [Drug: drug] in the treatment